Diabetic gastroparesis

The above is a clinical trial exclusion criterion. Annotated with entity spans:
[Condition: Diabetic gastroparesis]